Clinical trial exclusion criterion:
Subjects who have had an adequate trial of pregabalin.

Annotated entities:
- Competing_trial: "Subjects who have had an adequate trial of pregabalin"